Current (past 12 months) diagnosis of Panic disorder, Obsessive Compulsive Disorder, Posttraumatic Stress Disorder, Anorexia Nervosa, or Bulimia Nervosa.

The above is a clinical trial exclusion criterion. Annotated with entity spans:
Current ([Temporal: past 12 months]) diagnosis of [Condition: Panic disorder], [Condition: Obsessive Compulsive Disorder], [Condition: Posttraumatic Stress Disorder], [Condition: Anorexia Nervosa], or [Condition: Bulimia Nervosa].